Clinical trial exclusion criterion:
Patients who are on anticoagulation medication that may not be safely held for the procedure (≥ 5 days for antiplatelet agents and warfarin; ≥ 24 hours for low-molecular weight heparin formulations) will be excluded.

Entity relations:
- AND("anticoagulation medication", "may not be safely held for the procedure")
- Has_multiplier("low-molecular weight heparin", "≥ 24 hours")
- Has_multiplier("antiplatelet agents", "≥ 5 days")
- Has_multiplier("warfarin", "≥ 5 days")
- Subsumes("anticoagulation medication", "antiplatelet agents")
- OR("antiplatelet agents", "low-molecular weight heparin")
- OR("warfarin", "low-molecular weight heparin")